Clinical trial exclusion criterion:
Active symptomatic urinary infection

Entity relations:
- Has_qualifier("urinary infection", "symptomatic")